17. Subjects unwilling to use acceptable methods of contraception.

The above is a clinical trial exclusion criterion. Annotated with entity spans:
[Parsing_Error: 17.] Subjects [Condition: unwilling] to use [Qualifier: acceptable] methods of [Procedure: contraception].